Clinical trial exclusion criterion:
Patients with abnormal hematology or serum chemistry lab results

Entity relations:
- Has_value("hematology lab", "abnormal")
- OR("hematology lab", "serum chemistry lab")